Clinical trial inclusion criterion:
If HBV DNA is negative, the subject may be included but must undergo HBV DNA PCR testing monthly x 3 months beginning from the start of treatment

Annotated entities:
- Measurement: "HBV DNA"
- Value: "negative"
- Non-query-able: "must undergo HBV DNA PCR testing monthly x 3 months beginning from the start of treatment"